一位 3 歲兒童，吃蠶豆後因急性臉色蒼白、黃疸來診，並發現血色素尿，此時下列那項檢查結果可推測此兒童是因葡萄糖六磷酸脫氫酵素（G-6-PD）缺乏而引起之急性溶血？
A. 血紅素 F（HbF）值升高
B. 血液抹片見到斷裂的（fragmented）像被咬斷之紅血球細胞（bite cells）
C. 冷血凝反應（cold hemagglutinin test）呈陽性反應
D. 糖化血色素（glycosylated hemoglobin）升高

正確答案：B. 血液抹片見到斷裂的（fragmented）像被咬斷之紅血球細胞（bite cells）